Unwillingness or inability to adhere to treatment or to the follow-up visits

The above is a clinical trial exclusion criterion. Annotated with entity spans:
[Post-eligibility: Unwillingness or inability to adhere to treatment or to the follow-up visits]